下列喉癌的敘述何者正確？
A. 約 95%為腺癌（Adenocarcinoma）
B. 聲門上（Supraglottic type）比聲門部（glottic type）稍多
C. T1 之聲門癌診斷時約有 15%之病例有頸部轉移
D. 聲門癌不易轉移但若出現轉移則傾向雙側頸部淋巴結轉移

正確答案：D. 聲門癌不易轉移但若出現轉移則傾向雙側頸部淋巴結轉移